The virus that causes FIP, Feline Infectious Peritonitis belongs to what family?

The virus that causes FIP, Feline Infectious Peritonitis belongs to the family coronavirus.